Clinical trial inclusion criterion:
The ascertained lead impedance is between 200 and 1500 Ohm.

Entity relations:
- Has_value("ascertained lead impedance", "between 200 and 1500 Ohm")